Clinical trial inclusion criterion:
Age between 18 and 78 year-old.

Annotated entities:
- Person: "Age"
- Value: "between 18 and 78 year-old"